下列何者為傳播人畜共通萊姆病（Lyme disease）之病媒？
A. 鹿蜱（Ixodes dammini）
B. 鼠蚤（Xenopsylla cheopis）
C. 體蝨（body louse）
D. 臭蟲（bedbug）

正確答案：A. 鹿蜱（Ixodes dammini）